Clinical trial exclusion criterion:
Cardiac MRI T2* <10ms;

Entity relations:
- Has_value("Cardiac MRI T2*", "<10ms")